Clinical trial inclusion criteria:
HLA-A2 melanoma patients with :
either loco-regional or lymph node metastasis
transit nodules not surgically resectable
measurable cutaneous or visceral metastasis
Patients' tumor express Melan-A/MART-1 antigen.
No chemotherapy treatment (except for Deticene used before the first T cell clones infusion) or radiotherapy or immunotherapy in the last 4 weeks before infusion.
No other melanoma treatment during the protocol.
Life expectancy should be greater than 6 months.
General state with Karnowsky greater than 80, ECOG = 0, 1 or 2.
Patient should be negative for HIV and B and C hepatitis.
Biological parameters at the beginning of the study: leucocytes ³ 2000 elements per mm3, hemoglobin ³ 10.5g/dl, platelets ³ 100 000 per mm3, phosphatases alcalines transaminases £ 1 time 1/2 compared to the normal.
Signed informed consent

Annotated entities:
- Condition: "melanoma"
- Qualifier: "HLA-A2"
- Condition: "loco-regional metastasis"
- Condition: "lymph node metastasis"
- Condition: "transit nodules"
- Qualifier: "surgically resectable"
- Negation: "not"
- Procedure: "surgically"
- Condition: "visceral metastasis"
- Condition: "cutaneous metastasis"
- Qualifier: "measurable"
- Observation: "MART-1 antigen"
- Observation: "Melan-A antigen"
- Procedure: "chemotherapy"
- Negation: "No"
- Drug: "Deticene"
- Negation: "except for"
- Temporal: "before the first T cell clones infusion"
- Reference_point: "the first T cell clones infusion"
- Procedure: "radiotherapy"
- Procedure: "immunotherapy"
- Temporal: "in the last 4 weeks before infusion"
- Reference_point: "infusion"
- Condition: "melanoma"
- Temporal: "during the protocol"
- Procedure: "treatment"
- Observation: "Life expectancy"
- Value: "greater than 6 months"
- Measurement: "Karnowsky"
- Value: "greater than 80"
- Measurement: "ECOG"
- Value: "0, 1 or 2"
- Measurement: "HIV"
- Value: "negative"
- Measurement: "C hepatitis"
- Measurement: "B hepatitis"
- Measurement: "leucocytes"
- Value: "³ 2000 elements per mm3"
- Measurement: "hemoglobin"
- Value: "³ 10.5g/dl"
- Measurement: "platelets"
- Value: "³ 100 000 per mm3"
- Measurement: "phosphatases alcalines transaminases"
- Value: "£ 1 time 1/2 compared to the normal"
- Temporal: "at the beginning of the study"
- Reference_point: "the beginning of the study"
- Observation: "Signed informed consent"